Clinical trial exclusion criterion:
Peripartum bleeding

Annotated entities:
- Condition: "Peripartum bleeding"